Clinical trial exclusion criterion:
3. Patient is participating in another clinical trial which may affect this study's outcomes.

Annotated entities:
- Post-eligibility: "Patient is participating in another clinical trial which may affect this study's outcomes."
- Context_Error: "Patient is participating in another clinical trial which may affect this study's outcomes."